Clinical trial inclusion criterion:
Patients with diagnosis of multiple myeloma according to criteria of the International Myeloma Working Group

Entity relations:
- AND("multiple myeloma", "criteria of the International Myeloma Working Group")